下列那一種藥物可以用來當作海洛因（heroin）成癮者的替代式治療（substitution therapy）藥物？
A. naloxone
B. methadone
C. acamprosate
D. rimonabant

正確答案：B. methadone